下列有關陰道滴蟲的敘述，何者錯誤？
A. 根據非洲的研究顯示，陰道滴蟲症患者感染 HIV 的機率較高
B. 男性患者通常無明顯症狀，但也可能引起攝護腺炎
C. 首選用藥為 metronidazole
D. 由滋養體（trophozoite）及囊體（cyst）之形態來鑑別種類

正確答案：D. 由滋養體（trophozoite）及囊體（cyst）之形態來鑑別種類